Clinical trial inclusion criterion:
Treatment with Ticagrelor within 48 hours

Annotated entities:
- Drug: "Ticagrelor"
- Temporal: "within 48 hours"
- Procedure: "Treatment"